Parkinson's disease already treated with APOMORPHINE pump or justifying the use of the pump continuously day and night

The above is a clinical trial exclusion criterion. Annotated with entity spans:
[Condition: Parkinson's disease] already treated with [Drug: APOMORPHINE] pump or [Non-representable: justifying the use of the pump continuously day and night]